La diana de los antibacterianos aminoglicósidos es la:
1. DNA polimerasa.
2. Transpeptidación del péptidoglicano.
3. Subunidad 30S del ribosoma.
4. RNA polimerasa.
5. DNA girasa.

Respuesta correcta: 3. Subunidad 30S del ribosoma.